一位懷孕 28 週的婦女，因喪失意識送入急診，到院時無生命跡象。你立即開始為她做心肺復甦術，在執行心肺復甦術時，病人的姿勢應以何者最適當？
A. 墊高左臀，頭低腳高
B. 墊高右臀，平躺
C. 墊高右臀，頭低腳高
D. 墊高左臀，平躺

正確答案：B. 墊高右臀，平躺